Clinical trial inclusion criterion:
Male or female =18 years of age at Visit 1

Entity relations:
- Has_value("age", "=18 years")
- Has_index("at Visit 1", "Visit 1")
- Has_temporal("age", "at Visit 1")
- OR("Male", "female")